Clinical trial inclusion criterion:
BMI 18-35

Annotated entities:
- Measurement: "BMI"
- Value: "18-35"